What is Cellbase?

Cellbase is a comprehensive collection of RESTful web services for retrieving relevant biological information from heterogeneous sources. CellBase documentation can be found at http://docs.bioinfo.cipf.es/projects/cellbase.